Clinical trial inclusion criterion:
Creatinine less than or equal to 2.0 x upper limit of normal (ULN)

Entity relations:
- Has_value("Creatinine", "less than or equal to 2.0 x upper limit of normal (ULN)")